Clinical trial exclusion criteria:
1. Have dementia or delirium (as determined by the palliative care specialist) at study entry.
2. Are pregnant
3. Have been taking corticosteroids for longer than 48 hours.
4. Have pulmonary edema, ascites or pitting edema on clinical examination.
5. Are unable to walk.
6. Have a history of serious adverse gastrointestinal events (i.e., bleeding or perforation),history of a coagulopathy or current anti-coagulant use.
7. Have an ALT/AST>3x upper limit of normal.
8. Patients on methotrexate.
9. Patients taking melatonin receptor agonists (such as Rozerem® [ramelteon]).

Annotated entities:
- Condition: "dementia"
- Condition: "delirium"
- Temporal: "at study entry"
- Condition: "pregnant"
- Drug: "corticosteroids"
- Temporal: "longer than 48 hours"
- Condition: "pulmonary edema"
- Condition: "ascites"
- Condition: "pitting edema"
- Condition: "unable to walk"
- Temporal: "history"
- Condition: "adverse gastrointestinal events"
- Qualifier: "serious"
- Condition: "bleeding"
- Condition: "perforation"
- Condition: "coagulopathy"
- Temporal: "history"
- Drug: "anti-coagulant"
- Temporal: "current"
- Measurement: "ALT/AST"
- Value: ">3x upper limit of normal"
- Drug: "methotrexate"
- Drug: "melatonin receptor agonists"
- Drug: "Rozerem"
- Drug: "ramelteon"